Clinical trial exclusion criterion:
Fetus with IUGR

Entity relations:
- AND("Fetus", "IUGR")